What are the five traits associated with metabolic syndrome?

Metabolic syndrome is a disorder of energy utilization and storage, diagnosed by a co-occurrence of three out of five of the following medical conditions: abdominal (central) obesity, insulin resistance, hypertension, dyslipidemia and hyperglycemia.